Symptomatic primary knee osteoarthritis with failed conservative treatment at least 3 months

The above is a clinical trial inclusion criterion. Annotated with entity spans:
[Qualifier: Symptomatic] [Qualifier: primary] [Qualifier: knee] [Condition: osteoarthritis] with [Qualifier: failed] [Procedure: conservative treatment] [Temporal: at least 3 months]